Clinical trial inclusion criterion:
Elective surgery

Annotated entities:
- Procedure: "Elective surgery"